La afasia no fluida, motora o expresiva se vincula con lesiones en:
1. El área de Wernicke.
2. El fascículo arqueado.
3. La corteza motora.
4. El área de Broca.
5. La circunvolución angular.

Respuesta correcta: 4. El área de Broca.